Clinical trial exclusion criterion:
12. Heart rate <50 at time of screening

Annotated entities:
- Measurement: "Heart rate"
- Value: "<50"
- Temporal: "at time of screening"
- Reference_point: "time of screening"